Clinical trial inclusion criteria:
outpatients aged 18-70 years
confirmed diagnosis of H. pylori infection by at least one of the following methods: 13C-urea breath test, histology, rapid urease test or bacterial culture
an intention of H. pylori eradication treatment and have written inform consent
ability to read short messages on the mobile phone

Annotated entities:
- Visit: "outpatients"
- Person: "aged"
- Value: "18-70 years"
- Condition: "H. pylori infection"
- Measurement: "13C-urea breath test"
- Measurement: "histology"
- Measurement: "rapid urease test"
- Measurement: "bacterial culture"
- Informed_consent: "an intention of H. pylori eradication treatment and have written inform consent"
- Post-eligibility: "ability to read short messages on the mobile phone"